人類乳突病毒（HPV）16及18型與子宮頸癌的發生有密切關係，病毒的E6及E7蛋白較不會抑制下列何種抑癌基因的功能？
A. p53
B. RB
C. p21
D. BRCA1及BRCA2

正確答案：D. BRCA1及BRCA2